Clinical trial exclusion criterion:
calculated creatinine clearance less than 60 mL per minute

Entity relations:
- Has_value("calculated creatinine clearance", "less than 60 mL per minute")